The patient receive radical operation for colon cancer with negative margin.

The above is a clinical trial inclusion criterion. Annotated with entity spans:
The patient receive [Procedure: radical operation] for [Condition: colon cancer] with negative margin.